Clinical trial exclusion criterion:
Vulnerable patient populations including prisoners and institutionalized individuals.

Entity relations:
- OR("prisoners", "institutionalized")